Clinical trial exclusion criterion:
Use of any investigational or non-registered product (drug or vaccine) other than the study vaccine(s) within 30 days prior to the first vaccination, or planned use during the study period.

Annotated entities:
- Qualifier: "investigational"
- Qualifier: "non-registered"
- Drug: "product"
- Drug: "drug"
- Drug: "vaccine"
- Negation: "other than"
- Drug: "study vaccine(s)"
- Qualifier: "other than the study vaccine(s)"
- Temporal: "within 30 days prior to the first vaccination"
- Reference_point: "the first vaccination"
- Procedure: "vaccination"
- Temporal: "first"
- Mood: "planned"
- Temporal: "during the study period"
- Procedure: "use"